What is the result of Mff overexpression in mitochondria?

The Drp1 receptor Mff is a major regulator of mitochondrial fission, and its overexpression results in increased fission.